(4)Diagnosis or suspicion of secondary hypertension;

The above is a clinical trial exclusion criterion. Annotated with entity spans:
(4)[Mood: Diagnosis] or [Mood: suspicion] of [Condition: secondary hypertension];